Clinical trial exclusion criterion:
Serious medical comorbidities

Entity relations:
- Has_qualifier("medical comorbidities", "Serious")